Clinical trial exclusion criterion:
Use of anti-dementia medications (Aricept, Exelon, Razadyne) and memantine (Namenda)) or anti-Parkinsonian medications (Sinemet, amantadine, bromocriptine, pergolide, selegeline).

Annotated entities:
- Drug: "anti-dementia medications"
- Drug: "Aricept"
- Drug: "Exelon"
- Drug: "Razadyne"
- Drug: "memantine"
- Drug: "Namenda"
- Drug: "anti-Parkinsonian medications"
- Drug: "Sinemet"
- Drug: "amantadine"
- Drug: "bromocriptine"
- Drug: "pergolide"
- Drug: "selegeline"